Pregnant or lactating women, women of childbearing potential not employing adequate contraception

The above is a clinical trial exclusion criterion. Annotated with entity spans:
[Condition: Pregnant] or [Condition: lactating] [Person: women], [Person: women] of [Condition: childbearing potential] [Negation: not employing] adequate [Procedure: contraception]